Clinical trial exclusion criterion:
contraindication to the study drug

Annotated entities:
- Condition: "contraindication"
- Drug: "study drug"